Clinical trial inclusion criterion:
Able to use independently the device required for treatment by apomorphine

Entity relations:
- AND("apomorphine", "device")